Contraindication to anticoagulation (i.e., heparin, warfarin or another commercially available anticoagulation medication)

The above is a clinical trial exclusion criterion. Annotated with entity spans:
[Condition: Contraindication] to [Drug: anticoagulation] (i.e., [Drug: heparin], [Drug: warfarin] or a[Non-query-able: nother commercially available anticoagulation medication])